7. Age ≥18 years.

The above is a clinical trial inclusion criterion. Annotated with entity spans:
[Parsing_Error: 7.] [Person: Age] [Value: ≥18 years].